IQ greater than or equal to 70

The above is a clinical trial inclusion criterion. Annotated with entity spans:
[Measurement: IQ] [Value: greater than or equal to 70]